一位25歲的青年人患有乾癬，騎腳踏車跌倒後在右側大腿有一片擦傷，日後在傷口上長出一片乾癬病灶，此現象是乾癬的那一種特色？
A. Darier sign
B. Auspitz's sign
C. Nikolsky sign
D. Koebner phenomenon

正確答案：D. Koebner phenomenon